為了解患者主觀敘述之頻尿是否為真實，須採用下列何種測試或工具來作為評估，是否有頻尿的證據？
A. 膀胱紀錄／排尿日	（bladder chart/ voiding diary）
B. 一小時的護墊試驗（1-hour pad test）
C. 填充期膀胱內壓測量法（filling phase cystometry）
D. 無壓力尿流測量法（free uroflowmetry）

正確答案：A. 膀胱紀錄／排尿日	（bladder chart/ voiding diary）